Which biomarkers are currently used for Duchenne Muscular Dystrophy?

MRI measurements can be used as biomarkers of disease severity in ambulant patients with DMD.